Uncontrolled intercurrent or chronic illness

The above is a clinical trial exclusion criterion. Annotated with entity spans:
[Qualifier: Uncontrolled] [Condition: intercurrent] or [Condition: chronic illness]